一位婦女因超音波顯示出現卵巢實質腫瘤而住院做進一步的檢查，在一系列的檢查後，發現此病人合併出現 ascites 及 hydrothorax，臨床上判定為 Meigs' syndrome。此卵巢腫瘤最可能是下列何者？
A. Thecoma
B. Cystic teratoma
C. Endometrioma
D. Fibroma

正確答案：D. Fibroma